Clinical trial exclusion criteria:
neurological diseases
previous pelvic surgeries
diabetes
cognitive difficulties
vaginal and urinary infection

Annotated entities:
- Condition: "neurological diseases"
- Procedure: "pelvic surgeries"
- Temporal: "previous"
- Condition: "diabetes"
- Condition: "cognitive difficulties"
- Condition: "urinary infection"
- Grammar_Error: "and"
- Condition: "infection vaginal"